有關網狀結構（reticular formation）核群，下列何者以正腎上腺素（norepinephrine）為主要神經傳遞物質？
A. 藍斑核（locus coeruleus）
B. 縫核（raphe nucleus）
C. 腹側被蓋區 (ventral tegmental area）
D. 腳橋網狀核（pedunculopontine reticular nucleus）

正確答案：A. 藍斑核（locus coeruleus）